indication of general anesthesia with tracheal intubation

The above is a clinical trial inclusion criterion. Annotated with entity spans:
[Mood: indication] of [Procedure: general anesthesia] with [Procedure: tracheal intubation]